¿Qué gen se asocia con mayor frecuencia a mutaciones adquiridas en el cáncer de mama?.
1. p53.
2. PTEN.
3. BRCA-2.
4. BRCA-1.
5. Her2/neu.

Respuesta correcta: 1. p53.